Clinical trial inclusion criteria:
Patients with T2DM and CAS as defined below:
Clinical definitions
T2DM: Diagnosed according to the WHO criteria [53].
CAD:Presence of any one of the following: Angina plus positive exercise tolerance test, enzyme and/or Q wave positive myocardial infarction, angiographic evidence ( >50% stenosis of one vessel), percutaneous or surgical coronary revascularisation.
Aged between 18 and 75
Provided written consent for participation in the trial prior to any study-specific procedures or requirements.

Annotated entities:
- Condition: "T2DM"
- Condition: "CAS"
- Condition: "T2DM"
- Qualifier: "WHO criteria"
- Condition: "CAD"
- Condition: "Angina"
- Measurement: "exercise tolerance test"
- Value: "positive"
- Qualifier: "Q wave positive"
- Condition: "myocardial infarction"
- Qualifier: "enzyme positive"
- Condition: "angiographic evidence"
- Value: ">50%"
- Measurement: "stenosis of one vessel"
- Qualifier: "surgical"
- Qualifier: "percutaneous"
- Procedure: "coronary revascularisation"
- Person: "Aged"
- Value: "between 18 and 75"
- Observation: "written consent for participation in the trial"
- Temporal: "prior to any study-specific procedures or requirements"
- Reference_point: "any study-specific procedures or requirements"